Concurrent anti-inflammatory therapy, including corticosteroid therapy

The above is a clinical trial exclusion criterion. Annotated with entity spans:
[Temporal: Concurrent] [Procedure: anti-inflammatory therapy], including [Procedure: corticosteroid therapy]